Las benzodiacepinas disminuyen la ansiedad debido a que funcionan como:
1. Antagonistas de los receptores GABA.
2. Agonistas de los receptores GABA.
3. Antagonista de los receptores noradrenérgicos.
4. Agonista de los receptores noradrenérgicos.
5. Antagonistas de los receptores serotoninérgicos.

Respuesta correcta: 2. Agonistas de los receptores GABA.